Clinical trial inclusion criterion:
Stoke since less than 2 month

Annotated entities:
- Condition: "Stoke"
- Temporal: "since less than 2 month"